The current OCD symptoms are too severe that the patient cannot finish the evaluation or receive the ERP

The above is a clinical trial exclusion criterion. Annotated with entity spans:
The current [Condition: OCD symptoms] are too [Qualifier: severe] that the patient cannot finish the evaluation or receive the ERP